Clinical trial inclusion criterion:
Person is a K2, K3 or K4 ambulator based on Medicare Functional Classification Level (MFCL).

Annotated entities:
- Measurement: "Medicare Functional Classification Level"
- Measurement: "MFCL"
- Value: "K2, K3 or K4"